下列有關安非他命（Amphetamine）藥理作用的說明，何者錯誤？
A. Amphetamine 為一種中樞神經興奮劑
B. Amphetamine 可以用來改善注意力不集中症候群（attention-deficit/hyperactivity disorder, ADHD）
C. Amphetamine 會促進食慾，進而引起暴食症
D. Amphetamine 與 Cocaine 會產生交互依賴性（cross-dependence）

正確答案：C. Amphetamine 會促進食慾，進而引起暴食症